Clinical trial inclusion criterion:
Must provide informed consent and agree to comply with the trial protocol

Annotated entities:
- Informed_consent: "Must provide informed consent and agree to comply with the trial protocol"